Clinical trial exclusion criterion:
8. Other malignancy within 2 years prior to Day 1 of the study, except for those treated with surgical intervention only.

Annotated entities:
- Parsing_Error: "8."
- Temporal: "within 2 years prior to Day 1 of the study"
- Reference_point: "Day 1 of the study"
- Condition: "malignancy"
- Procedure: "surgical intervention"
- Negation: "except for"
- Condition: "those"
- Undefined_semantics: "those"